Clinical trial exclusion criterion:
Women who received chemotherapy for other disease entity in recent 1 year.

Annotated entities:
- Procedure: "chemotherapy"
- Temporal: "recent 1 year"